Clinical trial exclusion criterion:
Allergies to propofol

Annotated entities:
- Condition: "Allergies"
- Drug: "propofol"